Known carrier or infection for HIV/Hep B or C. HCV ab+ must be PCR-. HBV ab+ must be HBsAg- or undetectable DNA

The above is a clinical trial exclusion criterion. Annotated with entity spans:
Known carrier or [Condition: infection for HIV]/[Condition: Hep B] or C. [Condition: HCV ab+] must be [Qualifier: PCR-]. [Condition: HBV ab+] must be [Qualifier: HBsAg-] or [Condition: undetectable DNA]